Clinical trial inclusion criterion:
Patient body height greater or equal to 140 cm

Entity relations:
- Has_value("body height", "greater or equal to 140 cm")